Clinical trial inclusion criterion:
4. Subject is an acceptable candidate for elective, urgent or emergency coronary artery bypass graft (CABG).

Annotated entities:
- Condition: "coronary artery bypass graft (CABG)"
- Qualifier: "emergency"
- Qualifier: "urgent"
- Qualifier: "elective"